Según las revisiones más recientes, la heredabilidad del Cociente de Inteligencia (CI) se estima que tiene un valor de alrededor de 0.75; esto significa que:
1. El 75% del CI se debe a los genes.
2. El 25% del CI se debe al ambiente.
3. El 75% de la variación fenotípica observada entre los individuos de la población se debe a las diferencias genéticas entre esos mismos individuos.
4. El 75% de la variación fenotípica observada entre los individuos de la población se debe a las diferencias en el ambiente en el que se encuentras esos mismos individuos.

Respuesta correcta: 3. El 75% de la variación fenotípica observada entre los individuos de la población se debe a las diferencias genéticas entre esos mismos individuos.